Clinical trial exclusion criterion:
A previous history of intolerance to the study drug or related compounds and additives

Annotated entities:
- Temporal: "previous history"
- Condition: "intolerance"
- Drug: "study drug"
- Drug: "related compounds"